Clinical trial exclusion criterion:
Patients in recent receipt of live vaccinations within 4 weeks prior to enrolment

Annotated entities:
- Drug: "live vaccinations"
- Temporal: "within 4 weeks prior to enrolment"